Clinical trial exclusion criterion:
Severe cardiac disease, including New York Heart Association Class III or IV congestive heart failure, clinically significant aortic stenosis, history of cardiac arrest, use of a cardiac defibrillator, or uncontrolled angina

Entity relations:
- Has_qualifier("cardiac disease", "Severe")
- Has_value("New York Heart Association", "Class III or IV")
- Has_qualifier("aortic stenosis", "clinically significant")
- Has_qualifier("congestive heart failure", "New York Heart Association Class III or IV")
- Has_temporal("cardiac arrest", "history")
- OR("cardiac disease", "cardiac defibrillator", "cardiac arrest", "aortic stenosis", "congestive heart failure", "uncontrolled angina")